Clinical trial exclusion criterion:
4. Active opportunistic infection or active neurological disease that might confound evaluation.

Entity relations:
- multi("opportunistic infection", "opportunistic")
- Has_temporal("opportunistic infection", "Active")
- Has_temporal("neurological disease", "active")
- OR("opportunistic infection", "neurological disease")